Clinical trial exclusion criterion:
Uncontrolled hypertension (medication non-compliance or past 3 months with a diastolic reading of 105 as verified by compartment pressure of the rectus sheath (CPRS))

Annotated entities:
- Condition: "Uncontrolled hypertension"
- Qualifier: "Uncontrolled"
- Condition: "medication non-compliance"
- Temporal: "past 3 months"
- Measurement: "diastolic reading"
- Value: "105"
- Context_Error: "diastolic reading"
- Measurement: "compartment pressure of the rectus sheath (CPRS)"
- Qualifier: "as verified by compartment pressure of the rectus sheath (CPRS)"